一位 98 歲的女性，患有退化性關節炎而不良於行，三年來睡眠型態改變，常日夜顛倒。最近一年記憶力衰退，開始不記得人名。有胃口減少和體重減輕現象，最近更加嚴重，話也變少，不會表達肚 子餓或要上廁所，且比較嗜睡，小便少且顏色呈深黃。下列那一項處置對此病人較適當？
A. 周全性老年評估
B. 腦波檢查
C. 癌症腫瘤標記檢查
D. 上消化道攝影

正確答案：A. 周全性老年評估